Clinical trial exclusion criterion:
medical/psychiatric condition or substance abuse that is likely to affect your ability to complete this study

Annotated entities:
- Condition: "medical condition"
- Condition: "psychiatric condition"
- Condition: "substance abuse"